painful regular uterine contractions

The above is a clinical trial exclusion criterion. Annotated with entity spans:
[Condition: painful regular uterine contractions]